Pregnant or possibly pregnant woman, or breastfeeding woman, or woman who wishes to become pregnant during study participation;

The above is a clinical trial exclusion criterion. Annotated with entity spans:
[Pregnancy_considerations: Pregnant or possibly pregnant woman, or breastfeeding woman, or woman who wishes to become pregnant during study participation];